下列關於血清素症候群（serotonin syndrome）的臨床表現，何者錯誤？
A. 體溫升高
B. 譫妄
C. 便秘
D. 盜汗

正確答案：C. 便秘